Clinical trial inclusion criterion:
Critical limb ischemia (Rutherford category 4 or 5)

Annotated entities:
- Qualifier: "Critical"
- Condition: "limb ischemia"
- Measurement: "Rutherford category"
- Value: "4 or 5"